Body mass index (BMI) < 18.5 kg/m2 or > 25 kg/m2.

The above is a clinical trial exclusion criterion. Annotated with entity spans:
[Measurement: Body mass index] ([Measurement: BMI]) [Value: < 18.5 kg/m2 or > 25 kg/m2].